Clinical trial exclusion criterion:
score level D on the SIGAM mobility grade

Entity relations:
- Has_value("SIGAM mobility grade", "level D")